Se denomina transpeptidación a la etapa en la biosíntesis del péptidoglicano en la que:
1. Se produce la unión del ácido N-acetilmurámico con la N-acetil glucosamina, en el interior de la célula bacteriana.
2. Se produce la salida de los precursores desde el citoplasma al exterior.
3. Se produce la unión del precursor al péptidoglucano en el exterior, por enlaces glucosídicos.
4. Se produce la unión, por medio de puentes interpeptídicos, entre cadenas de péptidoglucano.
5. Actúan las autolisinas formando poros en su estructura.

Respuesta correcta: 4. Se produce la unión, por medio de puentes interpeptídicos, entre cadenas de péptidoglucano.